Clinical trial exclusion criterion:
Dysrhythmia that might pose a risk during exercise or training

Entity relations:
- multi("during exercise", "exercise")
- multi("during training", "training")
- Has_temporal("pose a risk", "during exercise")
- AND("Dysrhythmia", "pose a risk")
- OR("during exercise", "during training")